若急性心衰竭病人同時有血鈉過低之症狀，則下列何種藥物是最佳選擇？
A. spironolactone
B. losartan
C. conivaptan
D. eplerenone

正確答案：C. conivaptan